Clinical trial exclusion criterion:
Presence of acid reflux or heartburn symptoms of more than twice a month

Annotated entities:
- Condition: "acid reflux"
- Condition: "heartburn symptoms"
- Temporal: "more than twice a month"